Addition of trocar(s) or conversion of surgery to hand-assisted or open

The above is a clinical trial exclusion criterion. Annotated with entity spans:
[Mood: Addition of] [Drug: trocar](s) or [Observation: conversion of surgery] to [Procedure: hand-assisted] or [Procedure: open]